Clinical trial exclusion criterion:
Known severe peripheral vascular disease or major iliac arterial occlusive disease

Annotated entities:
- Condition: "peripheral vascular disease"
- Qualifier: "severe"
- Condition: "iliac arterial occlusive disease"
- Qualifier: "major"
- Subjective_judgement: "major"
- Subjective_judgement: "severe"